Which company developed eptinezumab?

Eptinezumab was developed by Lundbeck Seattle BioPharmaceuticals.